Clinical trial exclusion criteria:
NA

Annotated entities:
- Not_a_criteria: "NA"